Clinical trial inclusion criterion:
Alanine transaminase (ALT) (SGPT) ≤ 2.5 X institutional ULN

Entity relations:
- Has_value("Alanine transaminase (ALT) (SGPT)", "≤ 2.5 X institutional ULN")